一位 50 歲男病人，患慢性腎臟病 8 年，一個月前血清肌酸酐（creatinine）為 3.0 mg/dL 現因身體虛弱而就診，抽血發現血清肌酸酐 6.0 mg/dL，血鉀（K）7.2 mmol/L，心電圖呈現高而尖的 T 波及 QRS 期間（duration）延長的變化，下列敘述何者錯誤？
A. 給予口服鉀離子交換樹脂（potassium exchange resin）
B. 給予重碳酸鈉靜脈注射
C. 給予口服氧化鎂
D. 緊急血液透析治療

正確答案：C. 給予口服氧化鎂